no contraindications for chemotherapy

The above is a clinical trial inclusion criterion. Annotated with entity spans:
[Negation: no] [Condition: contraindications] for [Procedure: chemotherapy]